6. Documented stable angina pectoris [Canadian Cardiovascular Society Classification (CCS) 1, 2, 3, or 4], unstable angina pectoris with documented ischemia (Braunwald Class IB-C, IIB-C, or IIIB-C), non-ST segment elevation myocardial infarction, or documented silent ischemia.

The above is a clinical trial inclusion criterion. Annotated with entity spans:
6. Documented [Condition: stable angina pectoris] [[Measurement: Canadian Cardiovascular Society Classification (CCS)] [Value: 1, 2, 3, or 4]], [Condition: unstable angina pectoris] with [Observation: documented] [Condition: ischemia] ([Measurement: Braunwald Class] [Value: IB-C, IIB-C, or IIIB-C]), [Condition: non-ST segment elevation myocardial infarction], or [Observation: documented] [Condition: silent ischemia].